Clinical trial inclusion criterion:
Male and female subjects aged 20 years or older at informed consent

Annotated entities:
- Person: "Male"
- Person: "female"
- Person: "aged"
- Value: "20 years or older"
- Temporal: "at informed consent"
- Reference_point: "informed consent"